Clinical trial inclusion criterion:
The subject must be willingly and able to provide written informed consent

Annotated entities:
- Post-eligibility: "The subject must be willingly and able to provide written informed consent"